Clinical trial inclusion criteria:
English speaking
between 18 and 75 years old
American Society of Anesthesiologists (ASA) 1-3 patients undergoing primary total hip arthroplasty

Annotated entities:
- Non-query-able: "English speaking"
- Person: "old"
- Value: "between 18 and 75 years"
- Measurement: "American Society of Anesthesiologists"
- Measurement: "ASA"
- Value: "1-3"
- Procedure: "primary total hip arthroplasty"